Clinical trial exclusion criterion:
Patient has diabetes or is immunodepressed.

Annotated entities:
- Condition: "diabetes"
- Condition: "immunodepressed"